Clinical trial exclusion criterion:
Serum creatinine > 1.7mg/dL

Annotated entities:
- Measurement: "Serum creatinine"
- Value: "> 1.7mg/dL"